Qué modalidad de intervención familiar de la esquizofrenia tiene entre sus principales objetivos la reducción de la emoción expresada y del contacto con el paciente y el aumento de las redes sociales de la familia:
1. El modelo psicoeducativo de Anderson.
2. El modelo sociofamiliar de Leff.
3. El modelo cognitivo conductual de Tarrier.
4. La terapia familiar conductual de Fallon.

Respuesta correcta: 2. El modelo sociofamiliar de Leff.